Clinical trial exclusion criterion:
History of kidney stones

Annotated entities:
- Condition: "kidney stones"
- Temporal: "History"